Clinical trial inclusion criteria:
Age >=19 patients who complained of dizziness
Orthostatic hypotension after 3-minute standing (systolic blood pressure drop >=20 or diastolic blood pressure drop >=10

Annotated entities:
- Person: "Age"
- Value: ">=19"
- Condition: "dizziness"
- Condition: "Orthostatic hypotension"
- Qualifier: "after 3-minute standing"
- Measurement: "systolic blood pressure drop"
- Measurement: "diastolic blood pressure drop"
- Value: ">=10"
- Value: ">=20"